HEALTHY: known cardiovascular disease, cardiac risk factors or use of cardiac medications

The above is a clinical trial exclusion criterion. Annotated with entity spans:
[Condition: HEALTHY]: known [Condition: cardiovascular disease], [Condition: cardiac risk factors] or use of [Drug: cardiac medications]